Clinical trial exclusion criterion:
Subject has evidence of congestive heart failure (NYHA class II, III or IV) in sinus rhythm.

Annotated entities:
- Condition: "congestive heart failure"
- Measurement: "NYHA class"
- Value: "II"
- Value: "III"
- Value: "IV"
- Condition: "sinus rhythm"